下列何種情況血中 D-dimer 濃度不會異常升高？
A. Hemarthrosis
B. Five days after major operation
C. Brain sinus thrombosis
D. Inferior vena cava thrombosis

正確答案：A. Hemarthrosis